Clinical trial exclusion criterion:
Uterine abnormalities or myoma.

Annotated entities:
- Condition: "Uterine abnormalities"
- Condition: "myoma"